Clinical trial exclusion criterion:
Receipt of oral or injectable antibiotic therapy within 72 hours prior to the first blood draw

Annotated entities:
- Drug: "antibiotic therapy"
- Qualifier: "injectable"
- Qualifier: "oral"
- Temporal: "within 72 hours prior to the first blood draw"
- Reference_point: "the first blood draw"